What is the primary indication of tocilizumab?

Tocilizumab is considered first-line treatment for rheumatoid arthritis.